Clinical trial inclusion criterion:
MRSA on a baseline blood culture and on at least 1 additional blood culture after at least 72 hours of vancomycin and/or daptomycin treatment (Cohort B).

Entity relations:
- Has_temporal("blood culture", "baseline")
- Has_temporal("blood culture", "after at least 72 hours of vancomycin and/or daptomycin treatment")
- Has_multiplier("blood culture", "at least 1 additional")
- Has_context("blood culture", "MRSA")
- Has_index("after at least 72 hours of vancomycin and/or daptomycin treatment", "vancomycin and/or daptomycin treatment")
- OR("vancomycin treatment", "daptomycin treatment")